24 歲女性病患，主訴左右兩手之食指與中指近端指節腫痛約兩週，身體檢查時看到口腔黏膜潰瘍並摸到頸部淋巴腺腫，食指與中指近端指節腫脹，除此之外並無其他異常，一週後抗核抗體（ANA）報告是陽性（1：640，speckle），下列敘述何者正確？
A. 病患一定是全身性紅斑狼瘡（systemic lupus erythematosus）
B. 病患可能是（probable）全身性紅斑狼瘡
C. 抗核抗體陽性即可排除類風濕關節炎之可能
D. 若加上自體免疫抗體 anti-SSA（Ro）的存在即可確定是全身性紅斑狼瘡

正確答案：B. 病患可能是（probable）全身性紅斑狼瘡